Informed consent obtained

The above is a clinical trial inclusion criterion. Annotated with entity spans:
[Non-query-able: Informed consent obtained]